Clinical trial inclusion criterion:
Indication of kidney transplantation

Entity relations:
- Has_mood("kidney transplantation", "Indication")